Patients with findings of hemorrhage

The above is a clinical trial exclusion criterion. Annotated with entity spans:
Patients with findings of [Condition: hemorrhage]